Clinical trial exclusion criterion:
Current pregnancy or lactation.

Entity relations:
- Has_temporal("pregnancy", "Current")
- OR("pregnancy", "lactation")